Clinical trial exclusion criterion:
3. Cutaneous lesions and/or pressure ulcers

Entity relations:
- OR("Cutaneous lesions", "pressure ulcers")